Weight at least 45 kg

The above is a clinical trial inclusion criterion. Annotated with entity spans:
[Measurement: Weight] [Value: at least 45 kg]